Clinical trial inclusion criterion:
concomitant use of clopidogrel, or (9) Unwilling to accept random assignment of subjects

Annotated entities:
- Temporal: "concomitant"
- Drug: "clopidogrel"
- Informed_consent: "Unwilling to accept random assignment of subjects"